List 3 human diseases caused by  viruses in the family Paramyxoviridae.

Measles, mumps and encephalitis are diseases caused by viruses in the family Paramyxoviridae.